Clinical trial exclusion criterion:
Patients with high intracranial pressure.

Annotated entities:
- Measurement: "intracranial pressure"
- Value: "high"